下列有關炎症反應與介質（mediator）的配對，何者錯誤？
A. 血管擴張（vasodilation）與TNF, IL-1
B. 增加血管滲透性與C3a及C5a
C. 發燒（fever）與前列腺素（prostaglandins）
D. 疼痛（pain）與遲緩激肽（bradykinin）

正確答案：A. 血管擴張（vasodilation）與TNF, IL-1